Clinical trial inclusion criterion:
4. de novo native vessels;

Entity relations:
- Has_qualifier("native vessels", "de novo")